Clinical trial inclusion criterion:
1. Angina or equivalent symptoms > 20 min and

Entity relations:
- Has_temporal("Angina", "> 20 min")
- OR("Angina", "Angina symptoms")